Patient refusing to participate to the study

The above is a clinical trial exclusion criterion. Annotated with entity spans:
[Post-eligibility: Patient refusing to participate to the study]